Written informed consent obtained from the parent or guardian of the subject.

The above is a clinical trial inclusion criterion. Annotated with entity spans:
[Observation: Written informed consent] obtained from the [Qualifier: parent] or [Qualifier: guardian] of the subject.